Clinical trial inclusion criterion:
Physician-led sedation (if sedated; as opposed to nurse-led protocol)

Annotated entities:
- Procedure: "sedation"
- Qualifier: "Physician-led"
- Negation: "as opposed to"
- Qualifier: "nurse-led protocol"